Clinical trial exclusion criterion:
alergy to fish, protamine, protamine derivates, history of Humulin N, Novolin N, Novolin NPH, Gensulin N, SciLin N, NPH Iletin II and isophane insulin intake

Annotated entities:
- Condition: "alergy"
- Drug: "fish"
- Drug: "protamine"
- Drug: "protamine derivates"
- Drug: "Humulin N"
- Drug: "Novolin N"
- Drug: "Novolin NPH"
- Drug: "Gensulin N"
- Drug: "SciLin N"
- Drug: "NPH Iletin II"
- Drug: "isophane insulin"
- Temporal: "history"